body mass index < 46 kg/m2

The above is a clinical trial inclusion criterion. Annotated with entity spans:
[Person: body mass index] [Value: < 46 kg/m2]